Clinical trial exclusion criterion:
history of ARF,scarlet fever,impetigo,acute glomerulonephritis

Entity relations:
- Has_temporal("ARF", "history")
- OR("ARF", "acute glomerulonephritis", "scarlet fever", "impetigo")